Clinical trial inclusion criterion:
Written informed consent must be obtained before any intravitreal injection of bevacizumab is performed

Annotated entities:
- Informed_consent: "Written informed consent must be obtained before any intravitreal injection of bevacizumab is performed"